下列何種受體在交感神經末梢被活化後，會促進正腎上腺素的釋放？
A. α2
B. β2
C. Dopamine D2
D. Muscarinic M2

正確答案：B. β2